What type of drug is apixaban?

Apixaban is an anticoagulant.